Clinical trial exclusion criterion:
Suffering major events or having mood swings.

Annotated entities:
- Condition: "major events"
- Undefined_semantics: "major events"
- Subjective_judgement: "major events"
- Condition: "mood swings"